茂伯騎機車擦傷後，傷口一年多還不癒合而演變成骨髓炎，細菌培養長出非典型分支桿菌。追溯過去病史，他從少年開始就易受沙門氏菌等長期感染，他最可能罹患那一種類型的原發性免疫缺損？
A. CD8+ 細胞功能的缺損
B. IL-12-IFNγ軸心缺損
C. NK細胞功能的缺損
D. TH2 型免疫反應的缺損

正確答案：B. IL-12-IFNγ軸心缺損